Clinical trial inclusion criterion:
Male or female patients;

Entity relations:
- OR("Male", "female")